Clinical trial exclusion criterion:
Current smoker;

Annotated entities:
- Person: "smoker"